Característicamente los rotavirus son capaces de infectar:
1. El sistema linfático.
2. El tracto digestivo.
3. El aparato urogenital.
4. Las vías respiratorias superiores.

Respuesta correcta: 2. El tracto digestivo.